What is the biological role of Neddylation?

NEDDylation is a post-translational protein modification that is tightly linked to ubiquitination and thereby protein degradation. It however has its own enzyme machinery. It is coupled to ubiquitination and is important for maintaining cellular homeostasis.